下列為 case-control study、prospective cohort study 與 retrospective cohort study 的比較，何者錯誤？
A. 成本：prospective cohort study＞retrospective cohort study＞case-control study
B. 最易建立時序關係的是 retrospective cohort study
C. 只有 case-control study 無法計算 relative risk 和 absolute risk
D. case-control study 所用的樣本數相對較少

正確答案：B. 最易建立時序關係的是 retrospective cohort study